Clinical trial exclusion criterion:
History of blood clotting or bleeding abnormalities

Annotated entities:
- Temporal: "History"
- Condition: "blood clotting"
- Condition: "bleeding abnormalities"